Which deep learning framework has been developed for cancer molecular subtype classification?

DeepCC is a novel deep learning-based framework for cancer molecular subtype classification. It is based on deep learning of functional spectra quantifying activities of biological pathways. In two case studies about colorectal and breast cancer classification, DeepCC classifiers and DeepCC single sample predictors both achieved overall higher sensitivity, specificity, and accuracy.